Platelets <100 K/cumm

The above is a clinical trial exclusion criterion. Annotated with entity spans:
[Measurement: Platelets] [Value: <100 K/cumm]